Clinical trial exclusion criterion:
History of kidney stones

Annotated entities:
- Condition: "kidney stones"
- Temporal: "History of"